Clinical trial inclusion criterion:
ECOG performance status of 2 or lower

Entity relations:
- Has_value("ECOG performance status", "2 or lower")